Subject are at least 18 years of age

The above is a clinical trial inclusion criterion. Annotated with entity spans:
Subject are [Value: at least 18 years] of [Person: age]